Clinical trial exclusion criterion:
1. Prior treatment with gemcitabine, carboplatin (except in the adjuvant setting), or Iniparib.

Annotated entities:
- Drug: "gemcitabine"
- Drug: "carboplatin"
- Drug: "Iniparib"
- Temporal: "Prior"